病人無高血壓家族病史，每次到醫院看病時量血壓都在 170/90 mmHg 左右，但在家中自己測量血壓時則正常，約在 124/76 mmHg 左右，最可能的情形是：
A. 家中血壓計不準確
B. 自己量血壓技術不良
C. White coat hypertension
D. 生理上的 diurnal blood pressure change

正確答案：C. White coat hypertension